Clinical trial inclusion criterion:
obtained consent

Annotated entities:
- Non-query-able: "obtained consent"